Clinical trial inclusion criterion:
Unable to participate in all scheduled visits, treatment plan, or other trial procedures according to the protocol (except for the optional genetic component)

Entity relations:
- Has_negation("genetic component", "except for")
- Has_context("scheduled visits", "genetic component")
- Has_context("scheduled visits", "Unable to participate")
- OR("scheduled visits", "treatment plan", "trial procedures")